有關腦下腺促皮質素腺瘤（corticotroph adenoma）的敘述，下列何者錯誤？
A. 在診斷時常以巨腺瘤（macroadenoma）呈現
B. 大部分屬於嗜鹼性腺瘤（basophilic），只有少數為難染色性腺瘤（chromophobic）
C. Periodic-acid-Schiff（PAS）染色呈陽性反應
D. 易導致庫欣氏症候群（Cushing syndrome）

正確答案：A. 在診斷時常以巨腺瘤（macroadenoma）呈現